關於腹股溝疝氣（inguinal hernia），何者正確？
A. 最常見之術後及長期併發症都是疼痛
B. 各類疝氣中，女性最常出現股疝氣（femoral hernia）而非腹股溝疝氣
C. 腹腔鏡疝氣修補術容易學習且其復發率明顯比傳統方式低
D. 男性以間接型（indirect type）疝氣為主，女性則以直接型（direct type）較多

正確答案：A. 最常見之術後及長期併發症都是疼痛